Clinical trial exclusion criterion:
Anaphylactic reaction to a previous dose of TIV(trivalent influenza vaccine)

Entity relations:
- Subsumes("TIV", "trivalent influenza vaccine")
- AND("Anaphylactic reaction", "TIV")